下列有關 heparin 和 warfarin 之敘述，何者錯誤？
A. 採用 aPTT（activated partial thromboplastin time）來檢測 heparin 之抗凝血活性
B. 以 prothrombin time 來檢測 warfarin 之抗凝血活性
C. heparin 過量之拮抗劑為 Factor VIIa
D. warfarin過量之拮抗劑為冷凍血漿和Vit. K1

正確答案：C. heparin 過量之拮抗劑為 Factor VIIa